Clinical trial inclusion criteria:
Inclusion criteria includes all U.S. HCA hospitals with an adult ICU;
Note: Unit of randomization is the hospital, but the participants are hospital adult ICUs
All patients within adult ICUs are included, including rare patients <18 years and >=12 years.

Annotated entities:
- Visit: "U.S."
- Visit: "HCA hospitals"
- Person: "adult"
- Visit: "adult ICU"
- Non-representable: "Note: Unit of randomization is the hospital, but the participants are hospital adult ICUs"
- Visit: "adult ICUs"
- Person: "adult"
- Person: "rare patients"
- Value: "<18 years and >=12 years"
- Person: "year"